Clinical trial exclusion criterion:
neurodevelopmental disorders (including Trisomy 21)

Annotated entities:
- Condition: "neurodevelopmental disorders"
- Condition: "Trisomy 21"